Has a Child-Pugh A liver score within 7 days prior to first dose of study medication

The above is a clinical trial inclusion criterion. Annotated with entity spans:
Has a [Measurement: Child-Pugh] [Value: A] liver score [Temporal: within 7 days prior] to [Reference_point: first dose of study medication]